What are viral vectors used for in optogenetics?

Viral vectors are used to express optogenetic constructs in selected cells.